BMI 25-35 kg/m2,

The above is a clinical trial inclusion criterion. Annotated with entity spans:
[Measurement: BMI] [Value: 25-35 kg/m2],